Clinical trial exclusion criterion:
History of Crohn's Disease, Irritable Bowel Syndrome, radiation therapy in the rectoanal region

Entity relations:
- Has_qualifier("radiation therapy", "rectoanal region")
- Has_temporal("Crohn's Disease", "History")
- OR("Crohn's Disease", "Irritable Bowel Syndrome", "radiation therapy")